Age > 85 years

The above is a clinical trial exclusion criterion. Annotated with entity spans:
[Person: Age] [Value: > 85 years]